El acetil-CoA:
1. Se sintetiza a partir de piruvato en el citoplasma eucariótico.
2. Tiene un enlace fosfato rico en energía.
3. Presenta un nucleótido de guanina en el coenzima A.
4. Activa a la piruvato carboxilasa e inhibe a la piruvato deshidrogenasa.
5. Atraviesa fácilmente la membrana interna mitocondrial.

Respuesta correcta: 4. Activa a la piruvato carboxilasa e inhibe a la piruvato deshidrogenasa.